Clinical trial exclusion criterion:
Any contra-indication to liver transplantation per center protocol

Entity relations:
- AND("contra-indication", "liver transplantation")